Clinical trial inclusion criterion:
Healthy subjects or subjects with well controlled underlying disease.

Entity relations:
- Has_qualifier("underlying disease", "well controlled")
- OR("Healthy", "underlying disease")